What is the inheritance of Barth syndrome?

Barth syndrome (BTHS) has an X-linked recessive pattern of inheritance.